Clinical trial inclusion criterion:
Competent to provide informed consent

Annotated entities:
- Informed_consent: "Competent to provide informed consent"